Clinical trial inclusion criterion:
Infrequently uses condoms during sex with 1 or more partners of unknown HIV status who are known to be at substantial risk of HIV infection (IDU or bisexual male partner)

Annotated entities:
- Observation: "Infrequently uses condoms during sex"
- Multiplier: "1 or more"
- Person: "partners of unknown HIV status"
- Observation: "at substantial risk of HIV infection"
- Person: "IDU"
- Person: "bisexual male partner"